Clinical trial inclusion criteria:
Male and female patients, age 18-75 yrs.
COPD diagnosed according to GOLD, FEV1 40-80% predicted, SpO2 =92% at 750 m.
Born, raised and currently living at low altitude (<800m).
Written informed consent.

Annotated entities:
- Person: "Male"
- Person: "female"
- Person: "age"
- Value: "18-75 yrs"
- Condition: "COPD"
- Qualifier: "GOLD"
- Measurement: "FEV1"
- Value: "40-80% predicted"
- Measurement: "SpO2"
- Value: "=92%"
- Qualifier: "750 m"
- Observation: "living at low altitude"
- Value: "<800m"
- Informed_consent: "Written informed consent."